Las reacciones de hipersensibilidad de tipo III se caracterizan por:
1. La activación de mastocitos.
2. El depósito de inmunocomplejos.
3. La activación de macrófagos.
4. Aparición de un infiltrado de neutrófilos.
5. Reacciones de citotoxicidad.

Respuesta correcta: 2. El depósito de inmunocomplejos.